chronic pancreatitis

The above is a clinical trial exclusion criterion. Annotated with entity spans:
[Condition: chronic pancreatitis]